胺基糖苷類（aminoglycoside）藥物屬殺菌劑，通常用來治療革蘭氏陰性菌及少數革蘭氏陽性菌所引起之嚴重感染症，但厭氧菌對此類藥物卻是有抗性的，其原因主要是：
A. 細菌核糖體結合部位產生變異，使抗生素無法結合
B. 此類抗生素無法進入細菌細胞內
C. 抗生素結構被菌體分泌之酵素分解
D. 抗生素效力不夠

正確答案：B. 此類抗生素無法進入細菌細胞內